Clinical trial exclusion criterion:
Adults older than 45 and children younger than 18 years

Annotated entities:
- Person: "Adults"
- Value: "older than 45"
- Person: "children"
- Value: "younger than 18 years"